Clinical trial exclusion criterion:
Female planning to become pregnant or planning to discontinue contraceptive precautions.

Annotated entities:
- Person: "Female"
- Mood: "planning to become pregnant"
- Mood: "planning to discontinue"
- Observation: "contraceptive precautions"
- Mood: "planning to"
- Observation: "become pregnant"